Clinical trial inclusion criterion:
Subject has provided informed consent.

Annotated entities:
- Non-query-able: "Subject has provided informed consent."